Unwillingness or inability to cooperate, or for the parents or guardians to give consent, or for the child to give assent, or any condition of sufficient severity to impair cooperation in the study

The above is a clinical trial exclusion criterion. Annotated with entity spans:
[Observation: Unwillingness] or [Observation: inability to cooperate], or for the parents or guardians to give consent, or for the child to give assent, or any condition of sufficient severity to impair cooperation in the study